關於前庭神經核（vestibular nuclei）的敘述，下列何者錯誤？
A. 可發出前庭脊髓徑（vestibulospinal tract）
B. 部分神經纖維併入內側縱束（medial longitudinal fasciculus）
C. 主要與小腦齒狀核（dentate nucleus）相連繫
D. 可參與前庭眼球反射（vestibulo-ocular reflex）

正確答案：C. 主要與小腦齒狀核（dentate nucleus）相連繫